Clinical trial exclusion criterion:
Lack of cooperation in the screening phase

Annotated entities:
- Post-eligibility: "Lack of cooperation in the screening phase"